Clinical trial exclusion criterion:
Patients anticipated to receive metronidazole after enrollment.

Entity relations:
- Has_mood("metronidazole", "anticipated")